WHO (World Health organization) Performance status: 0, 1 or 2

The above is a clinical trial inclusion criterion. Annotated with entity spans:
[Measurement: WHO (World Health organization) Performance status]: [Value: 0, 1 or 2]